依照美國國家膽固醇教育計劃（NCEP ATP III），下列何者不屬於代謝症候群風險評估指標之一？
A. 高血壓
B. 高血糖
C. 高尿酸
D. 高血脂

正確答案：C. 高尿酸